下列有關骨骼肌收縮的敘述，何者錯誤？
A. 動作電位是經由 T-tubules 傳遞
B. 肌細胞內鈣離子濃度上升會促進肌動蛋白（actin）與肌凝蛋白（myosin）之交互作用
C. Ryanodine 受器是一種鈣離子釋放通道
D. 鈣離子是經由肌細胞膜釋放到細胞質內

正確答案：D. 鈣離子是經由肌細胞膜釋放到細胞質內